Clinical trial exclusion criterion:
major fetal abnormalities

Annotated entities:
- Qualifier: "major"
- Condition: "fetal abnormalities"